一位17歲的女性罹患蕁麻疹已有二年之久。時常會有無預警的發生全身搔癢、紅斑及條痕（erythema and wheal）出現。經服用抗組織胺（anti-histamine）有效，但是無法根除。則下列那一種檢查對疾病的病因追查最有幫忙？
A. 血清補體值（serum complement level）
B. 嗜伊紅性白血球的總數（total eosinophil count）
C. 抗過敏原IgE抗體的效價（allergen-specific IgE titer）
D. 血清冷凝球蛋白的存在（presence of serum cryoglobulin）

正確答案：C. 抗過敏原IgE抗體的效價（allergen-specific IgE titer）